Patients with cardiac failure or a history of cardiac failure (New York Heart Association [NYHA] Stages 3 to 4)

The above is a clinical trial exclusion criterion. Annotated with entity spans:
Patients with [Condition: cardiac failure] or a [Temporal: history of cardiac failure] ([Measurement: New York Heart Association] [[Measurement: NYHA]] Stages [Value: 3 to 4])